Clinical trial inclusion criterion:
Subjects who were hospitalized in the Geriatric Unit of the Emile Roux Hospital (AP-HP)

Annotated entities:
- Visit: "Geriatric Unit of the Emile Roux Hospital (AP-HP)"